一個足月兒出生體重 4.8 公斤，以頭位自產道產出，出生後之身體診察發現此嬰兒之驚嚇反射（Moro reflex）不對稱，右側沒有反應。此嬰兒同時有發紺現象伴隨不規則的費力呼吸，呼吸時兩側胸部動作不對稱，右側肋緣下沒有明顯凹陷，聽診時右側肺部呼吸音較小聲；此新生兒的臨床診斷最可能是下列何者？
A. 右側氣胸
B. 左側肺部塌陷
C. 右側上臂神經叢傷害
D. 右側下臂神經叢傷害

正確答案：C. 右側上臂神經叢傷害